下列何者不是由膜內骨化（intramembranous ossification）方式形成？
A. 上頜骨（maxilla）
B. 下頜骨（mandible）
C. 顳骨岩部（petrous part of temporal bone）
D. 頂骨（parietal bone）

正確答案：C. 顳骨岩部（petrous part of temporal bone）